Clinical trial exclusion criterion:
Allergy/hypersensitivity to acetaminophen

Annotated entities:
- Condition: "Allergy"
- Condition: "hypersensitivity"
- Drug: "acetaminophen"